Clinical trial inclusion criterion:
Subjects admitted to the hospital with acute or chronic medical illnesses or for elective and emergency surgical illness or trauma

Entity relations:
- Has_qualifier("medical illnesses", "acute")
- Has_qualifier("surgical illness", "elective")
- AND("admitted to the hospital", "medical illnesses")
- AND("admitted to the hospital", "surgical illness")
- OR("elective", "emergency")
- OR("acute", "chronic")
- OR("surgical illness", "trauma")
- OR("medical illnesses", "surgical illness")